某國中校護針對校內 10 名學生進行身高的測量，得到以下的數據：148、149、153、155、155、158 、161、162、166、170。該名校護在將數據輸入電腦準備進行分析時誤將其中一筆 149 誤鍵為 194
 。這種錯誤並不會影響下列何者的數值？
A. 平均值
B. 標準差
C. 眾數
D. 中位數

正確答案：C. 眾數